Clinical trial inclusion criterion:
1. Male or female, 18-75 years old.

Annotated entities:
- Parsing_Error: "1."
- Person: "Male"
- Person: "female"
- Value: "18-75 years"
- Person: "years old"